Clinical trial exclusion criterion:
previous UTI in the past 2 weeks

Annotated entities:
- Condition: "UTI"
- Temporal: "past 2 weeks"